Which gene therapy treatment is FDA approved for retinal dystrophy?

Luxturna is approved by the Food and Drug Administration (FDA) for the treatment of inherited retinal dystrophy.